Patients with chronic liver disease

The above is a clinical trial exclusion criterion. Annotated with entity spans:
Patients with [Qualifier: chronic] [Procedure: liver disease]